下列何者不受陰部神經（pudendal nerve）所支配？
A. 膀胱
B. 尿道
C. 陰道
D. 直腸

正確答案：A. 膀胱